Clinical trial exclusion criterion:
Current or chronic history of liver disease, or known hepatic or biliary abnormalities (with the exception of Gilbert's syndrome or asymptomatic gallstones).

Annotated entities:
- Temporal: "Current"
- Temporal: "chronic"
- Temporal: "history"
- Condition: "liver disease"
- Condition: "biliary abnormalities"
- Condition: "hepatic abnormalities"
- Condition: "Gilbert's syndrome"
- Negation: "exception"
- Condition: "gallstones"
- Qualifier: "asymptomatic"